Clinical trial exclusion criterion:
Active clinically significant bleeding

Entity relations:
- Has_qualifier("bleeding", "significant")
- Has_qualifier("bleeding", "Active")